En un estudio farmacoeconómico que comparó dos fármacos antibióticos en el tratamiento de la neumonía, fueron incluidos los costes de la medicación, de las pruebas complementarias y analíticas, de hospitalización, de los efectos adversos de la medicación, del transporte al hospital y de la pérdida de productividad de los pacientes. ¿Cuál fue la perspectiva del estudio?
1. Perspectiva hospitalaria.
2. Perspectiva del Sistema Nacional de Salud.
3. Perspectiva extrahospitalaria.
4. Perspectiva de la sociedad.

Respuesta correcta: 4. Perspectiva de la sociedad.